Clinical trial inclusion criterion:
Patient who agrees to participate in this study

Annotated entities:
- Observation: "agrees to participate in this study"
- Informed_consent: "Patient who agrees to participate in this study"